有關主動脈瓣膜置換的手術適應症，下列何者錯誤？
A. 一旦有症狀且合併嚴重主動脈瓣膜逆流，需要手術
B. 無症狀但合併嚴重主動脈瓣膜逆流及左心室射出比率< 50%，需要手術
C. 嚴重主動脈瓣膜逆流且合併三條冠狀動脈疾病，需要手術
D. 無症狀但合併主動脈瓣膜逆流、左心室射出比率> 50%及end-diastolic dimention < 70 mm，需要手術

正確答案：D. 無症狀但合併主動脈瓣膜逆流、左心室射出比率> 50%及end-diastolic dimention < 70 mm，需要手術